Clinical trial exclusion criterion:
Immunosuppression with cyclosporine or an mTOR inhibitor (everolimus or sirolimus).

Entity relations:
- Subsumes("mTOR inhibitor", "everolimus")
- AND("Immunosuppression", "cyclosporine")
- OR("everolimus", "sirolimus")
- OR("cyclosporine", "mTOR inhibitor")